18 years old or older

The above is a clinical trial inclusion criterion. Annotated with entity spans:
[Value: 18 years] [Person: old] or older